Clinical trial exclusion criterion:
PCOS patients

Annotated entities:
- Condition: "PCOS"